Clinical trial exclusion criterion:
History of head injury, seizures, or stroke

Entity relations:
- Has_temporal("head injury", "History")
- OR("head injury", "seizures", "stroke")